Clinical trial exclusion criterion:
Patients that require emergent release of a RBC transfusion and in whom emergency randomization could not be completed

Annotated entities:
- Procedure: "RBC transfusion"
- Procedure: "emergency randomization"
- Qualifier: "emergent release"
- Mood: "require"
- Negation: "could not be completed"